La característica central de los trastornos fóbicos es:
1. El miedo pero no la evitación de la situación.
2. La evitación de la situación, pero no el miedo a la misma.
3. Que el miedo y la evitación estén asociados a estímulos más o menos específicos.
4. Que el miedo no está asociado a estímulos específicos.
5. Que la persona adulta que padece este trastorno no es consciente de que su miedo es excesivo e irracional.

Respuesta correcta: 3. Que el miedo y la evitación estén asociados a estímulos más o menos específicos.